Clinical trial exclusion criterion:
Retransplantation or multiorgan transplantation

Annotated entities:
- Procedure: "Retransplantation"
- Procedure: "transplantation"
- Qualifier: "multiorgan"